關於 Pneumocystis pneumonia 的敘述下列何者錯誤？
A. Pathogen Pneumocystis jirovecii 是一種 protozoan
B. 常發生於AIDS患者，此時病患血液CD4+ 淋巴球數通常少於 200 cells/mm3
C. 利用氣管鏡進行bronchoalveolar lavage（BAL），在BAL fluid 利用Wright-Giemsa stain 可驗出pathogen
D. Trimethoprim-Sulfamethoxazole（TMP-SMX）是標準治療藥物

正確答案：A. Pathogen Pneumocystis jirovecii 是一種 protozoan